Una de las siguientes posiciones hace más susceptible al paciente de desarrollar úlceras por presión debido a las fuerzas de cizalla:
1. Decúbito supino.
2. Decúbito prono.
3. Decúbito semiprono.
4. Fowler.
5. Sims.

Respuesta correcta: 4. Fowler.